Clinical trial inclusion criteria:
Patient is currently enrolled in a Novartis-sponsored, Oncology Clinical Development & Medical Affairs study receiving nilotinib and has fulfilled all their requirements in the parent study
Patient is currently benefiting from the treatment with nilotinib, as determined by the investigator
Patient has demonstrated compliance, as assessed by the investigator, with the parent study protocol requirements
Willingness and ability to comply with scheduled visits, treatment plans and any other study procedures
Written informed consent obtained prior to enrolling in roll-over study

Annotated entities:
- Temporal: "currently"
- Qualifier: "Novartis-sponsored"
- Observation: "enrolled in a Oncology Clinical Development & Medical Affairs study"
- Drug: "nilotinib"
- Non-representable: "has fulfilled all their requirements in the parent study"
- Procedure: "treatment"
- Drug: "nilotinib"
- Non-representable: "as determined by the investigator"
- Temporal: "currently"
- Observation: "compliance with the parent study protocol requirements"
- Non-representable: "as assessed by the investigator"
- Mood: "Willingness to comply with scheduled visits"
- Mood: "ability to comply with scheduled visits"
- Mood: "Willingness to comply with treatment plans"
- Observation: "Written informed consent"
- Temporal: "prior to enrolling in roll-over study"
- Reference_point: "enrolling in roll-over study"